Degenerative Disc Disease (as defined by neck pain of discogenic origin with degeneration of the disc confirmed by patient history and radiographic studies)

The above is a clinical trial inclusion criterion. Annotated with entity spans:
[Condition: Degenerative Disc Disease] (as defined by [Condition: neck pain] of [Qualifier: discogenic origin] with [Condition: degeneration of the disc] confirmed by [Temporal: patient history] and [Procedure: radiographic studies])